Clinical trial exclusion criterion:
Need for acute psychiatric hospitalization or is suicidal

Entity relations:
- Has_temporal("psychiatric hospitalization", "acute")
- Has_context("psychiatric hospitalization", "Need for")
- OR("psychiatric hospitalization", "suicidal")